The above information is not intended to contain all considerations relevant to a patient's potential participation in a clinical trial.

The above is a clinical trial exclusion criterion. Annotated with entity spans:
[Not_a_criteria: The above information is not intended to contain all considerations relevant to a patient's potential participation in a clinical trial.]